Clinical trial exclusion criterion:
Pregnant or breast feeding women

Annotated entities:
- Condition: "Pregnant"
- Observation: "breast feeding"
- Person: "women"